Clinical trial inclusion criteria:
Signed informed consent form
Macula edema secondary to BRVO
BCVA of 77 to 20 letters assessed with the use of ETDRS charts
CRT <U+2267>250µm

Annotated entities:
- Informed_consent: "Signed informed consent form"
- Condition: "Macula edema"
- Condition: "BRVO"
- Measurement: "BCVA"
- Value: "77 to 20 letters"
- Measurement: "CRT"
- Value: "250µm"